下列那一種腎細胞癌與von Hippel-Lindau基因的突變或低表現有關？
A. 透明細胞腎細胞癌（clear cell renal cell carcinoma）
B. 類肉瘤腎細胞癌（sarcomatoid renal cell carcinoma）
C. 難染性腎細胞癌（chromophobe renal cell carcinoma）
D. 乳突狀腎細胞癌（papillary renal cell carcinoma）

正確答案：A. 透明細胞腎細胞癌（clear cell renal cell carcinoma）